Clinical trial inclusion criterion:
Moderate to severe COPD (post-bronchodilator forced expiratory volume in 1 s (FEV1) 30-79%predicted);

Annotated entities:
- Qualifier: "Moderate to severe"
- Condition: "COPD"
- Qualifier: "post-bronchodilator"
- Measurement: "forced expiratory volume in 1 s (FEV1)"
- Value: "30-79%predicted"